下列十二指腸內之何種狀況最容易抑制胃的排空（gastric empty）？
A. 低張性（hypotonicity）
B. pH值偏高
C. 高脂食糜
D. 低蛋白食糜

正確答案：C. 高脂食糜